年老女性發生肱骨頸部骨折時的敘述，何者正確？
A. 骨質疏鬆症病患很罕見
B. 遠端骨折塊嵌入近端斷塊的情形很罕見
C. 骨折不癒合（Nonunion）很罕見
D. 肩部僵硬的情形很罕見

正確答案：C. 骨折不癒合（Nonunion）很罕見